下列何種藥物作用於GABAB receptor？
A. baclofen
B. diazepam
C. tizanidine
D. dantrolene

正確答案：A. baclofen